下列何者不屬於目前美國食品與藥物管理局（FDA）認可的HIV抗病毒藥物？
A. 蛋白酶抑制劑（protease inhibitor）
B. 嵌入酶抑制劑（integrase inhibitor）
C. 核苷類似物反轉錄酶抑制劑（nucleoside analog RT inhibitor）
D. 病毒出芽抑制劑（budding inhibitor）

正確答案：D. 病毒出芽抑制劑（budding inhibitor）